張小姐 1 個月前駕車發生車禍，雖只有皮肉傷，但連續 1 個禮拜都睡不太著，經常夢見車禍景象，白天也很容易受突然的喇叭聲驚嚇，對車禍當時的狀況回想不起來，不敢開車上高速公路，因此在家靜養2週，再過了1週才完全恢復正常，張小姐最可能的診斷是什麼？
A. 創傷後壓力症（posttraumatic stress disorder）
B. 急性壓力症（acute stress disorder）
C. 恐慌症（panic disorder）
D. 畏懼症（phobic disorder）

正確答案：B. 急性壓力症（acute stress disorder）